於睫狀神經節（ciliary ganglion）中形成突觸（synapse）之節前神經纖維源自於：
A. 第七顱神經
B. 三叉神經（trigeminal nerve）中之眼神經（ophthalmic nerve）
C. 視神經（optic nerve）
D. 動眼神經（oculomotor nerve）

正確答案：D. 動眼神經（oculomotor nerve）